Current treatment with glycoproteins IIb-IIIa inhibitors

The above is a clinical trial inclusion criterion. Annotated with entity spans:
[Temporal: Current] [Procedure: treatment] with [Drug: glycoproteins IIb-IIIa inhibitors]